下列何者不會造成flaccid neuropathic bladder？
A. S2-S4 spinal cord受傷
B. 頸椎受傷（cervical spine injury）且有quadriplegia
C. Myelodysplasia造成anterior horn cell無法正常發育
D. Poliovirus感染並破壞anterior horn cell of spinal cord

正確答案：B. 頸椎受傷（cervical spine injury）且有quadriplegia